Child-bearing period women without effective contraceptive measures, pregnancy and lactation.

The above is a clinical trial exclusion criterion. Annotated with entity spans:
[Pregnancy_considerations: Child-bearing period women without effective contraceptive measures, pregnancy and lactation].